Clinical trial inclusion criterion:
Life expectancy greater than one year.

Annotated entities:
- Observation: "Life expectancy"
- Value: "greater than one year"